Clinical trial inclusion criterion:
female infertile patients eligible for IVF treatment

Entity relations:
- Has_mood("IVF treatment", "eligible")